Anxiety Cohort: Meet DSM-5 criteria for any of the following anxiety disorders: Social Anxiety Disorders, Generalized Anxiety Disorder, Separation Anxiety Disorder and/or Panic Disorder by structured interview (MINI-KID); ADIS Clinical Severity Rating ≥4 (moderately severe) for any of the 4 included anxiety disorders; Failure to achieve remission with at least 1 adequate prior anxiolytic medication trial (e.g. SSRI, SNRI, or TCA), meaning at least 8 weeks at therapeutic dosing, including at least 4 weeks of stable dosing; Failure to achieve remission with previous CBT or subject declines current CBT therapy

The above is a clinical trial inclusion criterion. Annotated with entity spans:
[Observation: Anxiety Cohort]: Meet [Qualifier: DSM-5 criteria] for any of the following [Condition: anxiety disorders]: [Condition: Social Anxiety Disorders], [Condition: Generalized Anxiety Disorder], [Condition: Separation Anxiety Disorder] and/or [Condition: Panic Disorder] by [Procedure: structured interview] ([Procedure: MINI-KID]); [Measurement: ADIS Clinical Severity Rating] [Value: ≥4] ([Qualifier: moderately severe]) for any of the 4 included [Condition: anxiety disorders]; [Negation: Failure] to achieve [Condition: remission] with [Multiplier: at least 1] [Qualifier: adequate] [Temporal: prior] [Procedure: anxiolytic medication trial] (e.g. [Drug: SSRI], [Drug: SNRI], or [Drug: TCA]), meaning [Multiplier: at least 8 weeks] at [Procedure: therapeutic dosing], including [Multiplier: at least 4 weeks] of [Procedure: stable dosing]; [Negation: Failure] to achieve [Condition: remission] with [Temporal: previous] [Procedure: CBT] or [Observation: subject declines] [Temporal: current] [Procedure: CBT therapy]